Clinical trial exclusion criterion:
Subjects with abnormal estimated glomerular filtration rate (eGFR).

Annotated entities:
- Value: "abnormal"
- Measurement: "estimated glomerular filtration rate (eGFR)"